細胞中基因轉錄（transcription）負責各種不同基因的表達。在轉錄的過程中，不需要下列那一項目？
A. 核糖核酸聚合酶（RNA polymerase）
B. 啟動子（promoter）
C. 去氧核糖核酸聚合酶（DNA polymerase）
D. 促進子（enhancer）

正確答案：C. 去氧核糖核酸聚合酶（DNA polymerase）